在門診與青少年會談時，下列何者為最合適之會談方式？
A. 青少年與父母一同會談→青少年單獨會談→青少年與父母一同會談
B. 青少年單獨會談→青少年與父母一同會談→青少年單獨會談
C. 父母單獨會談→青少年與父母一同會談→青少年單獨會談
D. 青少年單獨會談→青少年與父母一同會談→父母單獨會談

正確答案：A. 青少年與父母一同會談→青少年單獨會談→青少年與父母一同會談